Clinical trial exclusion criterion:
The patient is in an exclusion period determined by a previous study

Annotated entities:
- Non-query-able: "The patient is in an exclusion period determined by a previous study"